Clinical trial exclusion criterion:
Inability or unwillingness to comply with the treatment protocol, follow-up, or research tests.

Entity relations:
- OR("comply with the treatment protocol", "research tests", "follow-up")
- OR("Inability", "unwillingness")